¿Cuál es el número máximo de estereoisómeros de una aldohexosa?
1. 2.
2. 4.
3. 8.
4. 16.
5. 32.

Respuesta correcta: 4. 16.